¿Cuál de las siguientes afirmaciones es correcta en general, respecto del bienestar y la satisfacción con la vida?:
1. La personalidad no está relacionada con la felicidad.
2. Hay una relación inversa entre el estatus socio-económico y el bienestar subjetivo.
3. Las personas extrovertidas tienden a sentirse más felices que las introvertidas.
4. No existe relación entre el componente genético y el bienestar subjetivo.

Respuesta correcta: 3. Las personas extrovertidas tienden a sentirse más felices que las introvertidas.